Clinical trial exclusion criterion:
Neutrophil count <1500 cells/mm3 or platelet count <90,000 cells/mm3 at screening.

Entity relations:
- Has_value("Neutrophil count", "<1500 cells/mm3")
- Has_value("platelet count", "<90,000 cells/mm3")
- Has_temporal("Neutrophil count", "at screening")
- OR("Neutrophil count", "platelet count")